Clinical trial exclusion criterion:
Any other factor that, in the opinion of the investigator, would prevent the patient from complying with the requirements of the protocol.

Annotated entities:
- Post-eligibility: "Any other factor that, in the opinion of the investigator, would prevent the patient from complying with the requirements of the protocol."